Clinical trial inclusion criterion:
History of intracranial hemorrhage

Annotated entities:
- Condition: "intracranial hemorrhage"